Patients who consented to participate in the study by signing the informed consent form before the transplant surgery to the 1st post-operative day).

The above is a clinical trial inclusion criterion. Annotated with entity spans:
[Informed_consent: Patients who consented to participate in the study by signing the informed consent form before the transplant surgery to the 1st post-operative day)].